Co-infection with human immunodeficiency virus, hepatitis C virus, or hepatitis D virus

The above is a clinical trial exclusion criterion. Annotated with entity spans:
Co-infection with [Condition: human immunodeficiency virus], [Condition: hepatitis C virus], or [Condition: hepatitis D virus]